The participant has received a levodopa combination drug without change in the dose regimen.

The above is a clinical trial inclusion criterion. Annotated with entity spans:
The participant has received a [Drug: levodopa combination drug] [Qualifier: without change in the dose regimen].